Clinical trial exclusion criterion:
Women of child-bearing potential, who are biologically able to conceive, not employing two forms of highly effective contraception or who are pregnant.

Entity relations:
- Has_negation("highly effective contraception", "not")
- Has_multiplier("highly effective contraception", "two")
- AND("Women", "highly effective contraception")
- AND("Women", "child-bearing potential")
- AND("child-bearing potential", "biologically able to conceive")
- OR("highly effective contraception", "pregnant")